Subject has severe arterial insufficiency of the legs (Screening on physical examination= patients with diminution or absence of dorsalis pedis or posterior tibialis pulses. If diminished or absent by palpation, then an arterial ultrasound is required with vascular plethysmography. If the absolute arterial pressure is below 50mm of Hg at the calf or ankle level, then the patient is to be excluded) or other peripheral vascular disease).

The above is a clinical trial exclusion criterion. Annotated with entity spans:
Subject has [Qualifier: severe] [Condition: arterial insufficiency] of the [Qualifier: legs] ([Procedure: Screening on physical examination]= patients with [Condition: diminution or absence of dorsalis pedis] or posterior tibialis pulses. If [Observation: diminished] or [Observation: absent] by [Procedure: palpation], then an [Procedure: arterial ultrasound] is required with [Procedure: vascular plethysmography]. If the [Measurement: absolute arterial pressure] is [Value: below 50mm of Hg] at the [Qualifier: calf] or [Qualifier: ankle level], then the patient is to be [Negation: excluded]) or other [Condition: peripheral vascular disease]).